Clinical trial inclusion criterion:
GOLD 2: 0.50=FEV1<0.80 and FEV1/FVC < 0.70

Annotated entities:
- Measurement: "GOLD"
- Value: "2"
- Measurement: "FEV1"
- Value: "0.50= <0.80"
- Measurement: "FEV1/FVC"
- Value: "< 0.70"